Any use of a very-low-calorie (<1000 calories/day) weight loss diet within 6 months before Screening

The above is a clinical trial exclusion criterion. Annotated with entity spans:
Any use of a [Observation: very-low-calorie] ([Value: <1000 calories/day]) weight loss diet [Temporal: within 6 months before Screening]